Clinical trial inclusion criterion:
Histologically proven recurrent or persistent endometrial cancer that is not amenable to curative treatment with surgery and/or radiation therapy AND has failed 2 previous treatment regimens

Annotated entities:
- Measurement: "Histologically"
- Value: "proven"
- Qualifier: "amenable to curative treatment"
- Negation: "not"
- Procedure: "surgery"
- Procedure: "radiation therapy"
- Value: "2"
- Temporal: "previous"
- Procedure: "treatment regimens"
- Observation: "failed"
- Condition: "endometrial cancer"
- Qualifier: "persistent"
- Qualifier: "recurrent"